Clinical trial inclusion criterion:
Living in the study clusters

Annotated entities:
- Non-query-able: "Living in the study clusters"